Clinical trial exclusion criterion:
wish for pregnancy within next three months

Annotated entities:
- Temporal: "within next three months"
- Condition: "pregnancy"
- Mood: "wish for"